下列何種染色體變化較常見於濾泡型淋巴瘤（follicular lymphoma）？
A. t (1;14)，包含 BCL10 基因之變化
B. t (11;14)，包含 BCL1（cyclin D1）基因之變化
C. t (14;18)，包含 BCL2 基因之變化
D. t (11;18)，包含 BCL1（cyclin D1）或 BCL2 基因之變化

正確答案：C. t (14;18)，包含 BCL2 基因之變化